Clinical trial inclusion criterion:
8. Have a calculated creatinine clearance of >/= 60 cc/min.

Entity relations:
- Has_value("calculated creatinine clearance", ">/= 60 cc/min")